Anticipated inability to attend scheduled study visits;

The above is a clinical trial exclusion criterion. Annotated with entity spans:
[Post-eligibility: Anticipated inability to attend scheduled study visits];